Which are the parts of a flaggelum?

The bacterial flagellum is a supramolecular motility machine consisting of the basal body, the hook, and the filament.
The axial structure of the flagellum consists of the rod, hook, junction, filament, and cap.